根據世界衛生組織（WHO）的定義，關於肺結核（pulmonary tuberculosis）個案的診斷，下列敘述何者錯誤？
A. 未曾接受完整抗結核治療，且臨床檢體耐酸性（acid-fast）塗片兩套陽性者屬於新病例（new case）
B. 曾接受抗結核治療但未滿 2 週，且臨床檢體結核菌培養陽性者仍屬於新病例（new case）的定義
C. 失敗再治（treatment after failure）是指已治療 4 個月後，痰的耐酸性（acid-fast）塗片持續陽性
D. 失落再治（treatment after default）是指治療中斷 2 個月以上的個案

正確答案：C. 失敗再治（treatment after failure）是指已治療 4 個月後，痰的耐酸性（acid-fast）塗片持續陽性